Clinical trial inclusion criterion:
Completion of 6 weeks of physical therapy program

Entity relations:
- Has_temporal("physical therapy program", "6 weeks")